一位 50 歲的女性清潔工，長期有下背痛、下肢酸麻及間歇性跛行（intermittent claudication）。下列何者可幫助區分此患者是神經性（neurogenic）或血管性（vascular）間歇性跛行？
A. 快速行走
B. 慢跑
C. 騎腳踏車
D. 仰臥起坐

正確答案：C. 騎腳踏車